Clinical trial inclusion criterion:
operating time varies 1-4h,and extubation after the operation.

Entity relations:
- Has_value("operating time", "1-4h")
- multi("the operation", "operation")
- Has_index("after the operation", "the operation")
- AND("operating time", "extubation")
- Has_temporal("extubation", "after the operation")